關於安非他命的描述何者錯誤？
A. 常與促進腦中多巴胺（dopamine）的釋放有關
B. 安非他命中毒時，若停止使用，其中毒症狀多在2天內消失
C. 安非他命戒斷最嚴重的症狀是焦慮
D. 安非他命戒斷會使食慾增加

正確答案：C. 安非他命戒斷最嚴重的症狀是焦慮